下列何種流感病毒蛋白質是屬於質子通道（proton channel），與病毒釋放到細胞質有關？
A. 基質蛋白質（matrix protein, M1）
B. 膜蛋白質（membrane protein, M2）
C. 核殼體蛋白質（nucleocapsid protein, NP）
D. RNA聚合酶（polymerase, PA）

正確答案：B. 膜蛋白質（membrane protein, M2）